Clinical trial inclusion criterion:
BMI 25-35 kg/m2,

Entity relations:
- Has_value("BMI", "25-35 kg/m2")